Clinical trial exclusion criterion:
Patients with a medical or psychiatric illness that would preclude study or informed consent and/or history of noncompliance to medical regimens or inability or unwillingness to return for all scheduled visits

Annotated entities:
- Condition: "psychiatric illness"
- Condition: "medical illness"
- Observation: "preclude study"
- Observation: "informed consent"
- Observation: "noncompliance to medical regimens"
- Mood: "inability to return for all scheduled visits"
- Mood: "unwillingness to return for all scheduled visit"